Clinical trial exclusion criterion:
Subjects with taking any medication affecting level of LDL (Fenofibrate, Omega 3 fatty aicd etc.)

Annotated entities:
- Procedure: "LDL"
- Drug: "Fenofibrate"
- Drug: "medication"
- Condition: "affecting"
- Drug: "Omega 3 fatty aicd"